Clinical trial inclusion criterion:
ASA status I or II

Entity relations:
- Has_value("ASA status", "I or II")